Subjects admitted to the hospital with acute or chronic medical illnesses or for elective and emergency surgical illness or trauma

The above is a clinical trial inclusion criterion. Annotated with entity spans:
Subjects [Observation: admitted to the hospital] with [Qualifier: acute] or [Qualifier: chronic] [Condition: medical illnesses] or for [Qualifier: elective] [Grammar_Error: and] [Qualifier: emergency] [Condition: surgical illness] or [Condition: trauma]